復健物理儀器治療中，下列那一項不屬於深部熱療？
A. 短波
B. 微波
C. 向量干擾波
D. 超音波

正確答案：C. 向量干擾波